¿Cuál es el enfoque que estudia el autoconcepto a través de las polaridades?:
1. El análisis transaccional.
2. La terapia aversiva.
3. El autocontrol.
4. La terapia de Gestalt.
5. El condicionamiento encubierto.

Respuesta correcta: 4. La terapia de Gestalt.